Las células de Merkel son:
1. Secretoras de neuropéptidos y sensoriales.
2. Secretoras de moco.
3. Migratorias.
4. De Schwann.
5. Fibroblastos.

Respuesta correcta: 1. Secretoras de neuropéptidos y sensoriales.